Which proteins control the degradation of cryptic unstable transcripts (CUTs) in yeast?

Termination of cryptic unstable transcripts is directed by yeast RNA-binding proteins Nrd1 and Nab3